下列有關鬱血性心衰竭（congestive heart failure）的臨床表徵，何者為非？
A. 聽診出現 gallop rhythm
B. 出現 paradoxical pulse
C. 出現 pulse alternans
D. 肺部出現 moist rales

正確答案：B. 出現 paradoxical pulse